Prior spontaneous preterm birth or second trimester losses between 16(0) and 36(6) weeks

The above is a clinical trial exclusion criterion. Annotated with entity spans:
[Temporal: Prior] [Condition: spontaneous preterm birth] or [Qualifier: second trimester] [Condition: losses] [Qualifier: between 16(0) and 36(6) weeks]